Rheumatoid arthritis.

The above is a clinical trial exclusion criterion. Annotated with entity spans:
[Condition: Rheumatoid arthritis].